Clinical trial exclusion criterion:
Type I or II diabetes

Annotated entities:
- Condition: "Type I diabetes"
- Condition: "Type II diabetes"